Desiring pregnancy in the next year

The above is a clinical trial exclusion criterion. Annotated with entity spans:
[Pregnancy_considerations: Desiring pregnancy in the next year]